Clinical trial inclusion criterion:
History of previous myocardial infarction (MI)

Annotated entities:
- Condition: "myocardial infarction"
- Condition: "MI"